Clinical trial inclusion criterion:
Patient is a primary liver transplant recipient

Entity relations:
- AND("recipient", "primary liver transplant")